Clinical trial exclusion criterion:
Rifabutin, rifampin or rifapentine

Annotated entities:
- Drug: "Rifabutin"
- Drug: "rifampin"
- Drug: "rifapentine"